若以後方入路（posterior approach）方式施行全髖人工關節置換術（total hip replacement），則下列何肌肉必 須被切斷？
A. 臀中肌（gluteus medius muscle）
B. 臀小肌（gluteus minimus muscle）
C. 上孖肌（superior gemellus muscle）
D. 股外肌（vastus lateralis muscle）

正確答案：C. 上孖肌（superior gemellus muscle）